Clinical trial exclusion criterion:
Inability to keep return appointments

Annotated entities:
- Observation: "Inability to keep return appointments"